Has an acceptable history of NSAID use

The above is a clinical trial inclusion criterion. Annotated with entity spans:
Has an [Qualifier: acceptable] [Temporal: history] of [Drug: NSAID] use